副甲狀腺素可促進 1,25-二羥維生素 D3 [1,25-(OH)2-vitamin D3] 的生成，此一作用主要是發生在那一個器官？
A. 肝臟
B. 腎臟
C. 肺臟
D. 甲狀腺

正確答案：B. 腎臟